Clinical trial exclusion criterion:
low level of vitamin B12 and folate which are considered as clinically relevant

Entity relations:
- Has_value("level of vitamin B12", "low")
- Has_value("folate level of", "low")